經檢查後病患直腸損傷嚴重，縫合修補無法完全，下列何者不是適當之治療方法？
A. 臀部傷口清創處理
B. 腹部腸道分流造口術（stomy）
C. 傷口置放引流管
D. 剖腹切除直腸併腸吻合手術

正確答案：D. 剖腹切除直腸併腸吻合手術